Las carboxipeptidasas A y B:
1. Son endopeptidasas.
2. Se excretan por células exocrinas del intestino.
3. Se excretan por células exocrinas del estómago.
4. Se sintetizan por células endocrinas del hígado.
5. Se sintetizan por células exocrinas del páncreas.

Respuesta correcta: 5. Se sintetizan por células exocrinas del páncreas.